下列乳房症狀何者最可能需要考慮手術？
A. 乳房疼痛
B. 乳頭單一管道自然性流血
C. 乳頭多發性管道白色分泌物
D. 乳暈的 Montgomery gland 突起

正確答案：B. 乳頭單一管道自然性流血